On dual or triple antiplatelet therapy and between 12months and 14months from Bioresorbable Vascular Scaffold implantation

The above is a clinical trial inclusion criterion. Annotated with entity spans:
On [Procedure: dual] or [Procedure: triple antiplatelet therapy] and [Temporal: between 12months and 14months from Bioresorbable Vascular Scaffold implantation]